Recurrent urogenital infections

The above is a clinical trial exclusion criterion. Annotated with entity spans:
[Multiplier: Recurrent] [Condition: urogenital infections]